Clinical trial inclusion criterion:
Patients had an inadequate response to, or had failed to tolerate, 1 or more of the following conventional therapies: oral 5-aminosalicylates, oral corticosteroids, azathioprine (AZA), and/or 6-mercaptopurine (6MP); or corticosteroid dependent (ie, an inability to taper corticosteroids without recurrence of UC symptoms).

Annotated entities:
- Condition: "inadequate response"
- Condition: "failed to tolerate"
- Multiplier: "1 or more"
- Drug: "oral 5-aminosalicylates"
- Drug: "oral corticosteroids"
- Drug: "azathioprine (AZA)"
- Drug: "6-mercaptopurine (6MP)"
- Drug: "corticosteroid"
- Condition: "dependent"
- Non-representable: "(ie, an inability to taper corticosteroids without recurrence of UC symptoms)"